Clinical trial inclusion criterion:
5. Be on stable dose of at least one of the following PAH-specific therapies: endothelin receptor antagonist, an agent acting on the nitric oxide pathway (phosphodiesterase type 5 inhibitor or soluble guanylate cyclase stimulator), and/or a prostacyclin or prostacyclin analog.

Annotated entities:
- Parsing_Error: "5."
- Qualifier: "stable dose"
- Multiplier: "at least one"
- Procedure: "PAH-specific therapies"
- Drug: "endothelin receptor antagonist"
- Drug: "agent acting on the nitric oxide pathway"
- Drug: "phosphodiesterase type 5 inhibitor"
- Drug: "soluble guanylate cyclase stimulator"
- Drug: "prostacyclin analog"
- Drug: "prostacyclin analog"